關於移植體對抗宿主疾病（graft-versus-host disease, GVHD），下列何者錯誤？
A. 需要接受者的抗原呈獻細胞（antigen presenting cells）啟動
B. 可運用混合淋巴球反應（mixed lymphocyte reaction）檢測
C. 因接受者的 T 細胞過多造成
D. 可以去除移植體的 T 細胞而減緩其反應

正確答案：C. 因接受者的 T 細胞過多造成